Woman who are breastfeeding, pregnant or planning to become pregnant during the course of the study

The above is a clinical trial exclusion criterion. Annotated with entity spans:
[Person: Woman] who are [Observation: breastfeeding], [Condition: pregnant] or [Mood: planning to become] [Condition: pregnant] [Temporal: during the course of the study]